Receipt of any investigational medicinal product within 30 days before randomization

The above is a clinical trial exclusion criterion. Annotated with entity spans:
[Non-query-able: Receipt of any investigational medicinal product within 30 days before randomization]